Clinical trial exclusion criterion:
History or known presence of potential metabolic causes of myelopathy (e.g., untreated vitamin B12 deficiency)

Annotated entities:
- Condition: "myelopathy"
- Condition: "metabolic causes"
- Condition: "vitamin B12 deficiency"
- Qualifier: "untreated"